Clinical trial inclusion criterion:
Stable body weight during the previous 6 months, based on Investigator judgment.

Entity relations:
- Has_qualifier("body weight", "Stable")
- Has_temporal("body weight", "during the previous 6 months")